Las aminas primarias dan reacciones de condensación con aldehídos y cetonas produciendo:
1. Iminas.
2. Enaminas.
3. Amidas.
4. Hidrazinas.
5. Purinas.

Respuesta correcta: 1. Iminas.